Clinical trial inclusion criterion:
3. Weight: At least 60 kg (132 lbs) for man and 48 kg (106 lbs) for women and within 15% of Ideal Body Weight (IBW), as referenced by the Table of ""Desirable Weights of Adults"" Metropolitan Life Insurance Company, 1999 (See Part II ADMINISTRATIVE ASPECTS OF BIOEQUIVALENCE PROTOCOLS).

Annotated entities:
- Measurement: "Weight"
- Value: "At least 60 kg"
- Value: "At least 132 lbs"
- Person: "man"
- Value: "At least 48 kg"
- Value: "At least 106 lbs"
- Person: "women"
- Value: "within 15% of Ideal Body Weight (IBW)"